Clinical trial exclusion criterion:
Patients with contraindications listed in the currently valid SP

Annotated entities:
- Condition: "contraindications"
- Qualifier: "listed in the currently valid SP"